Anti-hypertensive therapy received in the past 12 hours

The above is a clinical trial exclusion criterion. Annotated with entity spans:
[Procedure: Anti-hypertensive therapy] received in the [Temporal: past 12 hours]